Clinical trial inclusion criterion:
No narcotic before surgery as premedication

Entity relations:
- Has_temporal("narcotic", "before surgery")
- Has_index("before surgery", "surgery")
- multi("surgery", "surgery")
- Has_negation("narcotic", "No")